Positive serum antibody against Hep B surface antigen and/or core Hep B core antigen

The above is a clinical trial exclusion criterion. Annotated with entity spans:
[Value: Positive] [Measurement: serum antibody] against [Qualifier: Hep B surface antige]n and/or [Qualifier: core Hep B core antigen]